Clinical trial inclusion criterion:
Clinical suspicion of Morton neuroma confirmed in ultrasound scan

Entity relations:
- AND("Morton neuroma", "ultrasound scan")
- Has_mood("Morton neuroma", "Clinical suspicion")